Malignancy within 5 years before Screening

The above is a clinical trial exclusion criterion. Annotated with entity spans:
[Condition: Malignancy] [Temporal: within 5 years before Screening]